Clinical trial exclusion criterion:
Child-Pugh score > 12

Entity relations:
- Has_value("Child-Pugh score", "> 12")